下列有關脊髓損傷引起之肌張力（muscle tone）過強之治療，何者最不適當？
A. 口服 Baclofen
B. 適當的伸展運動（stretching）
C. 早期手術治療
D. 正確的擺位

正確答案：C. 早期手術治療